Clinical trial exclusion criterion:
History of a seizure disorder other than a single childhood febrile seizure.

Annotated entities:
- Condition: "seizure disorder"
- Condition: "childhood febrile seizure"
- Multiplier: "single"
- Temporal: "History"
- Negation: "other than"